Contraindication for the use of corticosteroids or local anesthetics

The above is a clinical trial exclusion criterion. Annotated with entity spans:
[Condition: Contraindication] for the use of [Drug: corticosteroids] or [Drug: local anesthetics]